renal impairment - CrCl =60 mL/minute

The above is a clinical trial exclusion criterion. Annotated with entity spans:
[Condition: renal impairment] - [Measurement: CrCl] [Value: =60 mL/minute]